Clinical trial exclusion criterion:
Lung reduction surgery

Annotated entities:
- Procedure: "Lung reduction surgery"